關於中風後產生之複雜區域疼痛症候群第一型（complex regional pain syndrome, Type 1），下列身體部位中， 何處被影響程度相對較少？
A. 肩膀
B. 肘部
C. 手腕
D. 手指

正確答案：B. 肘部